Which molecule is targeted by Teprotumumab?

Teprotumumab is a human monoclonal antibody that targets IGF-1R. It can be used for treatment of thyroid eye disease.